Clinical trial inclusion criterion:
parturient in labour without cervical dilation and regular uterine contractions

Entity relations:
- Has_negation("cervical dilation", "without")
- OR("cervical dilation", "regular uterine contractions")